Insufficient knowledge of German

The above is a clinical trial inclusion criterion. Annotated with entity spans:
[Observation: Insufficient knowledge of German]